Los Aminoacil-tRNAs:
1. Son los precursores de los tRNAs.
2. Son enzimas que catalizan las síntesis de los aminoácidos.
3. Forman parte de los ribosomas.
4. Son los tRNAs cargados con el aminoácido especificado por su secuencia anticodón.
5. Son sintetizados por la RNA Polimerasa II.

Respuesta correcta: 4. Son los tRNAs cargados con el aminoácido especificado por su secuencia anticodón.